Clinical trial inclusion criterion:
Discharged from hospital following non-trauma related admission

Entity relations:
- AND("Discharged from hospital", "non-trauma related admission")
- multi("Discharged from hospital", "hospital")